Men and women 35 to 70 years of age

The above is a clinical trial inclusion criterion. Annotated with entity spans:
[Person: Men] and [Person: women] [Value: 35 to 70 years] of [Person: age]